Clinical trial exclusion criterion:
YAG laser treatment in the study eye in last 30 days prior to study enrollment.

Entity relations:
- Has_qualifier("YAG laser treatment", "in the study eye")
- Has_index("in last 30 days prior to study enrollment", "study enrollment")
- Has_temporal("YAG laser treatment", "in last 30 days prior to study enrollment")